Which drugs acting via bradykinin system are effective for treatment of ACE-inhibitor-induced angioedema?

Icatibant and ecallantide are medication acting via bradykinin system that are used for treatment of ACE-inhibitor-induced angioedema.